Clinical trial exclusion criterion:
anticoagulants usage

Annotated entities:
- Drug: "anticoagulants"